Current therapy with Insulin, thiazolidinediones, steroids or atypical antipsychotic medication

The above is a clinical trial exclusion criterion. Annotated with entity spans:
Current therapy with [Drug: Insulin], [Drug: thiazolidinediones], [Drug: steroids] or [Drug: atypical antipsychotic medication]